一年輕男子於車禍中，肱骨的橈溝（radial groove）處遭受橫向撞擊而骨折，傷及通過其間之神經，下列何種功能最可能受到影響？
A. 腕關節屈曲（flexion of wrist）
B. 手指關節之伸展（extension of fingers）
C. 腕關節之旋前功能（pronation of wrist）
D. 肩關節之外展（abduction of shoulder）

正確答案：B. 手指關節之伸展（extension of fingers）